¿Cuál de las siguientes características del método Volhard utilizado en las valoraciones por precipitación es CIERTA?:
1. Se utiliza una disolución de Fe (II) como indicador del punto final.
2. La valoración debe llevarse a cabo a pH alcalino para que se produzca una precipitación del indicador como óxido hidratado.
3. En la valoración indirecta de ion cloruro por este método, se adiciona un exceso de nitrato de plata estándar y el que no reacciona se valora con una disolución de patrón de tiocianato.
4. No es útil para la titulación de iones plata (Ag+).

Respuesta correcta: 3. En la valoración indirecta de ion cloruro por este método, se adiciona un exceso de nitrato de plata estándar y el que no reacciona se valora con una disolución de patrón de tiocianato.